Clinical trial exclusion criterion:
Patients anticipated to receive adjunctive C. difficile therapy (rifaxamin, nitazoxanide, tigecycline) after enrollment.

Entity relations:
- Subsumes("C. difficile therapy", "rifaxamin")
- Has_mood("C. difficile therapy", "anticipated")
- OR("rifaxamin", "nitazoxanide", "tigecycline")